¿Cuál de las siguientes se correlaciona con la retinopatía del recién nacido prematuro?
1. La bilirrubina.
2. La gentamicina.
3. Los corticoides.
4. El oxígeno.
5. El fentanilo.

Respuesta correcta: 4. El oxígeno.